When was Vitravene approved in Brazil?

Vitravene was approved in Brazil in the summer of 1999.